Present symptoms of other skin diseases, except chronic atopic dermatitis, that could disturb the study assessment and evaluation of the skin

The above is a clinical trial exclusion criterion. Annotated with entity spans:
Present symptoms of other [Condition: skin diseases], [Negation: except] [Condition: chronic atopic dermatitis], that [Qualifier: could disturb the study assessment and evaluation of the skin]